Clinical trial exclusion criterion:
Pregnancy and Lactation

Entity relations:
- OR("Pregnancy", "Lactation")